Which molecule is targeted by Camrelizumab?

Camrelizumab is a humanised antibody that targets programmed death-1 (PD-1) ligand.